Active autoimmune disease requiring immunosuppressive therapy within 30 days

The above is a clinical trial exclusion criterion. Annotated with entity spans:
[Temporal: Active] [Condition: autoimmune disease] [Qualifier: requiring] [Procedure: immunosuppressive therapy] [Temporal: within 30 days]